subarachnoid anaesthesia

The above is a clinical trial inclusion criterion. Annotated with entity spans:
[Procedure: subarachnoid anaesthesia]